下列有關成人疫苗注射的建議，何者錯誤？
A. 有慢性疾病之老年人應每年接種流行性感冒疫苗
B. 流行性感冒疫苗是活菌疫苗，孕婦及有慢性心肺疾病之老年人不應接受注射
C. 孕婦及免疫不全宿主不應注射活菌疫苗（如 MMR）
D. 50 歲以上之成人每 10 年追加一劑 Td（破傷風 tetanus 及白喉 diphtheria）成人劑型

正確答案：B. 流行性感冒疫苗是活菌疫苗，孕婦及有慢性心肺疾病之老年人不應接受注射